Life expectancy > 3 months.

The above is a clinical trial inclusion criterion. Annotated with entity spans:
[Observation: Life expectancy] [Value: > 3 months].